Clinical trial exclusion criterion:
Known hypersensitivity or intolerability to prednisolone (or prednisone, or equivalent), TAC, or MMF at a dose of 1.25 g or below per day.

Annotated entities:
- Condition: "hypersensitivity"
- Condition: "intolerability"
- Drug: "prednisolone"
- Drug: "prednisone"
- Drug: "prednisone equivalent"
- Drug: "TAC"
- Drug: "MMF"
- Multiplier: "1.25 g or below per day"